Clinical trial inclusion criterion:
Gender: male or female;

Annotated entities:
- Person: "Gender"
- Value: "male"
- Value: "female"